Clinical trial exclusion criterion:
Any condition that the investigators feel could compromise the use of the current medication.

Annotated entities:
- Post-eligibility: "Any condition that the investigators feel could compromise the use of the current medication."